BMI between 20 and 34 kg/m2

The above is a clinical trial inclusion criterion. Annotated with entity spans:
[Measurement: BMI] [Value: between 20 and 34 kg/m2]